De los siguientes apartados, ¿cuál NO forma parte de una propuesta de investigación?:
1. Experiencia personal.
2. Resumen.
3. Recursos disponibles.
4. Método de investigación.

Respuesta correcta: 1. Experiencia personal.